Patients in paliative care

The above is a clinical trial exclusion criterion. Annotated with entity spans:
[Context_Error: Patients in paliative care]